Clinical trial exclusion criterion:
Optune compliance < 75%; they would be excluded from the final analyses.

Entity relations:
- Has_multiplier("Optune compliance", "< 75%")